Una distensión se define cómo:
1. Lesión de los tejidos blandos.
2. Movimiento forzado de producción brusca.
3. Lesión por estiramiento de un músculo.
4. Lesión de la cápsula articular.
5. Interrupción en la continuidad de un hueso.

Respuesta correcta: 3. Lesión por estiramiento de un músculo.